¿Qué permite la evaluación de la personalidad basada en los datos “T” propuestos por R.B. Cattell?:
1. Evaluar muestras amplias con test psicometricamente fiables.
2. Evaluar de forma más cualitativa e ideográfica.
3. Evaluar a partir de pruebas y datos objetivos no manipulables por la persona.
4. Evaluar con pruebas que presentan una validez externa elevada.

Respuesta correcta: 3. Evaluar a partir de pruebas y datos objetivos no manipulables por la persona.